Clinical trial exclusion criterion:
Previous vaccination against meningococcal disease with either the study vaccine or another meningococcal vaccine

Annotated entities:
- Procedure: "vaccination against meningococcal disease"
- Drug: "study vaccine"
- Drug: "another meningococcal vaccine"